Subjects who are unlikely to adhere to the study an/or poor adherence anticipated by the investigator.

The above is a clinical trial exclusion criterion. Annotated with entity spans:
[Post-eligibility: Subjects who are unlikely to adhere to the study an/or poor adherence anticipated by the investigator].